Clinical trial exclusion criterion:
congenital or valvular cardiomyopathy;

Annotated entities:
- Qualifier: "valvular"
- Qualifier: "congenital"
- Condition: "cardiomyopathy"